Clinical trial exclusion criterion:
Clinically significant out of range values of serum levels of either alanine aminotransferase (ALT), aspartate aminotransferase (AST) or alkaline phosphatase (ALP) in the Investigator's opinion.

Entity relations:
- Has_value("alanine aminotransferase (ALT)", "out of range values")
- Has_qualifier("out of range values", "Clinically significant")
- OR("alanine aminotransferase (ALT)", "aspartate aminotransferase (AST)", "alkaline phosphatase (ALP)")